5. Patients with carpal tunnel syndrome must have had a diagnosis by combination clinical neurological examination (e.g., Phalen's and Tinel's signs), electrodiagnostic testing, and daily painful symptoms of at least 3 months' duration

The above is a clinical trial inclusion criterion. Annotated with entity spans:
5. Patients with [Condition: carpal tunnel syndrome] must have had a diagnosis by combination [Procedure: clinical neurological examination] (e.g., [Condition: Phalen's] and [Condition: Tinel's signs]), [Procedure: electrodiagnostic] testing, and [Multiplier: daily] [Condition: painful symptoms] of [Temporal: at least 3 months' duration]